有關雙極性疾患（bipolar disorder）之描述，下列何者正確？
A. 躁症症狀出現於老年期，須考慮失智症或譫妄之鑑別診斷
B. 典型首次發病型態常為躁期
C. 相較於重鬱症，第二型雙極性疾患（bipolar II disorder）之自殺危險性較低
D. 長期追蹤發現半數以上個案終生只發病一次

正確答案：A. 躁症症狀出現於老年期，須考慮失智症或譫妄之鑑別診斷